Clinical trial inclusion criterion:
Serum bicarbonate <15 mmol/L

Annotated entities:
- Measurement: "Serum bicarbonate"
- Value: "<15 mmol/L"